Clinical trial inclusion criterion:
Hoehn and Yahr Scale score of 1 - 3

Annotated entities:
- Measurement: "Hoehn and Yahr Scale score"
- Value: "1 - 3"